contraindication to ketamine and lidocaine

The above is a clinical trial exclusion criterion. Annotated with entity spans:
[Condition: contraindication] to [Drug: ketamine] and [Drug: lidocaine]